¿En cuál de los siguientes tipos de anemia se pueden observar alteraciones del sistema nervioso relacionadas con procesos de desmielinización?:
1. Anemia ferropénica.
2. Anemia hemolítica.
3. Anemia por déficit de ácido fólico.
4. Anemia por déficit de vitamina B12.

Respuesta correcta: 4. Anemia por déficit de vitamina B12.